關於 B 型肝炎之傳染途徑，下列何者錯誤？
A. B 型肝炎病毒主要經由體液（包括血液及生殖液）傳染
B. 水平感染在盛行區較為重要
C. 在臺灣垂直感染為主要傳染途徑
D. 共用牙刷、刮鬍刀、打針針具、輸血、血液透析、性行為、穿耳洞、刺青等亦為傳染途徑

正確答案：B. 水平感染在盛行區較為重要